Clinical trial exclusion criterion:
Redo surgeries

Annotated entities:
- Procedure: "Redo surgeries"